Clinical trial exclusion criterion:
Recent administration of any i.v. or s.c. anticoagulation within 12 hours, including unfractionated heparin, enoxaparin, and/or bivalirudin or current use of oral anticoagulation (i.e. warfarin or a NOACs)

Annotated entities:
- Drug: "anticoagulation"
- Temporal: "within 12 hours"
- Drug: "unfractionated heparin"
- Drug: "enoxaparin"
- Drug: "bivalirudin"
- Drug: "oral anticoagulation"
- Drug: "warfarin"
- Drug: "NOACs"